40歲海洛因毒癮患者因為喘，發燒及胸痛2天，前來急診就診。這位靜脈注射毒癮者，如果發生感染性心內膜炎，最可能的致病菌為：
A. Staphylococcus aureus
B. Staphylococcus epidermidis
C. Viridans streptococcus
D. Enterococcus faecalis

正確答案：A. Staphylococcus aureus